Chronic use of analgesic drugs (more than 3 months)

The above is a clinical trial exclusion criterion. Annotated with entity spans:
[Temporal: Chronic] use of [Drug: analgesic drugs] ([Temporal: more than 3 months])